Pregnancy or breastfeeding, or expecting to conceive while in study;

The above is a clinical trial exclusion criterion. Annotated with entity spans:
[Pregnancy_considerations: Pregnancy or breastfeeding, or expecting to conceive while in study];